Clinical trial inclusion criterion:
the legal guardians participate in all the planned follow-up and be able to comply with all research procedures

Annotated entities:
- Post-eligibility: "the legal guardians participate in all the planned follow-up and be able to comply with all research procedures"